Cuando analiza en uno de sus pacientes la organización social de la comunidad donde vive, el clima, el abastecimiento de aguas y calidad del aire, las posibilidades de empleo y la tasa de paro, el número de profesionales de la salud a los que puede acudir, los factores genéticos, la mortalidad, el sexo y la edad; usted está valorando todos los determinantes de la salud EXCEPTO:
1. Estilo de vida.
2. Biología.
3. Entorno.
4. Sistema Sanitario.

Respuesta correcta: 1. Estilo de vida.